Clinical trial inclusion criterion:
Advanced hormone-dependent prostate cancer without any other clinically significant disorder

Annotated entities:
- Qualifier: "Advanced"
- Qualifier: "hormone-dependent"
- Condition: "prostate cancer"
- Non-query-able: "without any other clinically significant disorder"